Clinical trial inclusion criterion:
Must sign informed consent

Annotated entities:
- Informed_consent: "Must sign informed consent"